Clinical trial exclusion criterion:
Caffeine use exceeding 5 cups of coffee per day or its equivalent;

Annotated entities:
- Drug: "Caffeine"
- Non-query-able: "Caffeine use exceeding 5 cups of coffee per day or its equivalent"